Clinical trial exclusion criterion:
Type 1 diabetes mellitus,presence of autoimmune diabetes indicated by antibodies to insulin, islet cells, and GAD;

Annotated entities:
- Condition: "Type 1 diabetes mellitus"
- Condition: "autoimmune diabetes"
- Condition: "antibodies"
- Qualifier: "insulin"
- Qualifier: "islet cells"
- Qualifier: "GAD"